Taking therapeutic doses of anti-coagulants or anti-platelet therapy (prophylactic doses started because of hospital admission are not an exclusion)

The above is a clinical trial exclusion criterion. Annotated with entity spans:
Taking [Qualifier: therapeutic] doses of [Drug: anti-coagulants] or [Drug: anti-platelet therapy] ([Qualifier: prophylactic] doses started because of hospital admission are [Negation: not] an exclusion)